若病人有 interferon-γ/interleukin-12 pathway 缺陷，較易罹患一些特殊感染，下列何者除外？
A. non-tuberculous mycobacteria
B. Mycobacterium tuberculosis
C. Listeria monocytogenes
D. Pseudomonas aeruginosa

正確答案：D. Pseudomonas aeruginosa